下列關於美克耳氏憩室（Meckel's diverticulum）之敘述，何者正確？
A. 其為後天性疾病
B. 腸套疊（intussusception）較不常發生
C. 可能含異位胰臟組織
D. 支持療法為最佳的治療

正確答案：C. 可能含異位胰臟組織